Clinical trial inclusion criterion:
sedentary or insufficiently active;

Annotated entities:
- Observation: "sedentary"
- Observation: "insufficiently active"